contra indication to dexamethasone

The above is a clinical trial exclusion criterion. Annotated with entity spans:
[Condition: contra indication] to [Drug: dexamethasone]